Body Mass Index (BMI) = 35 kg/m2

The above is a clinical trial inclusion criterion. Annotated with entity spans:
[Measurement: Body Mass Index (BMI)] [Value: = 35 kg/m2]